16. Women who are breastfeeding or pregnant as evidenced by positive serum pregnancy test

The above is a clinical trial exclusion criterion. Annotated with entity spans:
[Parsing_Error: 16.] [Person: Women] who are [Observation: breastfeeding] or [Condition: pregnant] as evidenced by [Value: positive] [Measurement: serum pregnancy test]